Clinical trial exclusion criterion:
Severe liver failure (CI to oral AVK)

Entity relations:
- Has_qualifier("liver failure", "Severe")